Clinical trial exclusion criterion:
Renal dysfunction defined as serum creatinine >2.0mg/dL

Annotated entities:
- Condition: "Renal dysfunction"
- Measurement: "serum creatinine"
- Value: ">2.0mg/dL"